Clinical trial inclusion criterion:
VAS leg pain of at least 40/100 at baseline.

Entity relations:
- Has_value("VAS leg pain", "at least 40/100")
- Has_temporal("VAS leg pain", "at baseline")